How many amino acids does davunetide consist of?

Davunetide or NAP is an eight amino acid peptide.